Clinical trial inclusion criteria:
Possible or probable Alzheimer's disease (National Institute of Neurological and Communicative Disorders and Stroke - Alzheimer's Disease and Related Disorders Association (NINCDS-ADRDA) criteria), with Mini-Mental State Exam (MMSE) score of 10-26 inclusive; MMSE scores above 26 in those who nevertheless meet criteria for AD may be allowed with Steering Committee approval on a case by case basis
Clinically significant apathy for at least four weeks for which either 1) the frequency of apathy as assessed by the Neuropsychiatric Inventory (NPI) is 'Very frequently', or 2) the frequency of apathy as assessed by the NPI is 'Frequently' or 'Often' AND the severity of apathy as assessed by the NPI is 'Moderate' or 'Marked'
A medication for apathy is appropriate, in the opinion of the study physician
Provision of informed consent for participation in the study by patient or surrogate (if the patient is unable to provide informed consent) and caregiver
Availability of primary caregiver, who spends greater than ten hours a week with the patient and supervises his/her care, to accompany the patient to study visits and to participate in the study
Sufficient fluency, of both the patient and caregiver, in written and spoken English to participate in study visits, physical exams, and outcome assessments
No change to AD medications within the month preceding randomization, including starting, stopping, or dosage modifications
Treatment with stable doses of selective serotonin reuptake inhibitor antidepressants(SSRIs) is appropriate if stable for 3 months prior to randomization. Other psychotropics(with the exclusion of antipsychotics), if stable for 3 months, may be allowed only with Steering Committee approval on a case by case basis.

Annotated entities:
- Condition: "Alzheimer's disease"
- Measurement: "National Institute of Neurological and Communicative Disorders and Stroke - Alzheimer's Disease and Related Disorders Association (NINCDS-ADRDA) criteria"
- Value: "probable"
- Value: "Possible"
- Measurement: "Mini-Mental State Exam (MMSE)"
- Value: "score of 10-26 inclusive"
- Measurement: "MMSE"
- Value: "scores above 26"
- Condition: "AD"
- Condition: "apathy"
- Person: "at least four weeks"
- Measurement: "Neuropsychiatric Inventory (NPI)"
- Value: "Very frequently"
- Measurement: "NPI"
- Value: "Frequently"
- Value: "Often"
- Measurement: "NPI"
- Observation: "severity of apathy"
- Observation: "frequency of apathy"
- Value: "Moderate"
- Value: "Marked"
- Observation: "frequency of apathy"
- Drug: "medication for apathy"
- Condition: "apathy"
- Post-eligibility: "A medication for apathy is appropriate, in the opinion of the study physician"
- Parsing_Error: "A medication for apathy is appropriate, in the opinion of the study physician"
- Post-eligibility: "Provision of informed consent for participation in the study by patient or surrogate (if the patient is unable to provide informed consent) and caregiver"
- Post-eligibility: "Availability of primary caregiver, who spends greater than ten hours a week with the patient and supervises his/her care, to accompany the patient to study visits and to participate in the study"
- Post-eligibility: "Sufficient fluency, of both the patient and caregiver, in written and spoken English to participate in study visits, physical exams, and outcome assessments"
- Drug: "AD medications"
- Temporal: "within the month preceding randomization"
- Reference_point: "randomization"
- Observation: "change to AD medications"
- Negation: "No"
- Drug: "selective serotonin reuptake inhibitor antidepressants(SSRIs)"
- Qualifier: "stable doses"
- Procedure: "Treatment"
- Context_Error: "Treatment with stable doses of selective serotonin reuptake inhibitor antidepressants(SSRIs) is appropriate if stable for 3 months prior to randomization. Other psychotropics(with the exclusion of antipsychotics), if stable for 3 months, may be allowed only with Steering Committee approval on a case by case basis."